在實	中給予實	鼠氯化鈣溶液灌注以提高其血鈣濃度，下列何者為最可能之預期變化？
A. 抑鈣素（calcitonin）分泌減少
B. 骨質流失（bone demineralization）
C. 減少噬骨細胞（osteoclast）的活性
D. 減少凝血作用（blood coagulation）

正確答案：C. 減少噬骨細胞（osteoclast）的活性